Clinical trial exclusion criterion:
Subject unwilling to cease use of any treatment for erectile dysfunction during the study, including oral medication, vacuum devices, constrictive devices, injections, urethral suppositories, gels, any over-the-counter or nonprescription medications, and products purchased via the internet

Entity relations:
- AND("treatment", "erectile dysfunction")
- Has_temporal("treatment", "during the study")
- Has_qualifier("medications", "over-the-counter")
- Subsumes("treatment", "oral medication")
- Has_negation("cease use of", "unwilling")
- Has_mood("treatment", "cease use of")
- OR("over-the-counter", "nonprescription")
- OR("oral medication", "vacuum devices", "constrictive devices", "injections", "urethral suppositories", "gels", "medications")